Clinical trial exclusion criterion:
Patients who received systemic anti-cancer treatment prior to the first dose of study drug within the following time frames:

Entity relations:
- Has_index("prior to the first dose of study drug", "the first dose of study drug")
- Has_temporal("systemic anti-cancer treatment", "prior to the first dose of study drug")